Clinical trial exclusion criterion:
Use of aspirin or salicylate- containing products within 30 days before enrollment

Annotated entities:
- Drug: "aspirin"
- Drug: "salicylate- containing products"
- Temporal: "within 30 days before enrollment"